Clinical trial exclusion criterion:
1. Justifications: the risk of TMS for individuals with a heart condition is unknown.

Annotated entities:
- Parsing_Error: "1."
- Parsing_Error: "Justifications: the risk of TMS for individuals with a heart condition is unknown."
- Not_a_criteria: "Justifications: the risk of TMS for individuals with a heart condition is unknown."